28歲G1P0孕婦，妊娠28週時，經診斷為子宮內胎兒生長遲滯（intrauterine fetel growth restriction, IUGR），爾後即於門診接受規律性產前檢查。目前妊娠38週，產前檢查安排之胎心率監測呈現良好反應（reactive），無規律性子宮收縮；超音波檢查羊水指數（amniotic fluid  index）3.2 cm，預估胎兒體重1900 公克，陰道內診子宮頸未開，破水測試（nitrazine test）呈現陰性反應。此時的最適當處置為：
A. 安排產前檢查門診追蹤觀察
B. 進一步安排臍動脈都卜勒測量檢查（umbilical arterial Doppler velocimetry）
C. 進一步安排催產素激發試	（oxytocin challenge test）
D. 安排住院引產

正確答案：D. 安排住院引產